蛋白激酶A（Protein kinase A）具有下列何種特性？
A. 與cyclic AMP共價鍵結合而活化
B. 與cyclic AMP共價鍵結合而抑制
C. cyclic AMP與酵素的異位性結合位（allosteric site）結合而使酵素活化
D. 受到cyclic AMP的競爭性抑制

正確答案：C. cyclic AMP與酵素的異位性結合位（allosteric site）結合而使酵素活化